ASA physical status 1-3

The above is a clinical trial inclusion criterion. Annotated with entity spans:
[Measurement: ASA physical status] [Value: 1-3]